Patient on chemotherapy

The above is a clinical trial exclusion criterion. Annotated with entity spans:
Patient on [Procedure: chemotherapy]